impaired decision making

The above is a clinical trial exclusion criterion. Annotated with entity spans:
[Condition: impaired decision making]